內囊後區（posterior section of internal capsule）、腦幹（brainstem）及脊髓（spinal cord）之錐體系統 （pyramidal system）出現核磁共振影像（MRI, T2）對稱性信號增強病灶，則最有可能的疾病是：
A. Hirayama disease
B. amyotrophic lateral sclerosis
C. spinocerebellar ataxia type III
D. progressive spinal muscular atrophy

正確答案：B. amyotrophic lateral sclerosis